下列各種組織中，何者不是以第二型膠原蛋白（type II collagen）為主要組成成分？
A. 關節面的透明軟骨（hyaline cartilage）
B. 膝關節內的半月板（meniscus）
C. 脊椎椎間盤的髓核（nucleus pulposus）
D. 脊椎椎間盤與椎體相鄰的終板（endplate）

正確答案：B. 膝關節內的半月板（meniscus）